Clinical trial exclusion criterion:
Current known infection with human immunodeficiency virus (HIV), active hepatitis B and/or hepatitis C virus.

Annotated entities:
- Condition: "human immunodeficiency virus (HIV)"
- Temporal: "Current"
- Condition: "hepatitis B virus"
- Condition: "hepatitis C virus"